Clinical trial exclusion criterion:
Use of other investigational study drugs within 1 year prior to study entry

Annotated entities:
- Drug: "investigational study drugs"
- Temporal: "within 1 year prior to study entry"